Clinical trial inclusion criterion:
20 - 100 yrs old

Entity relations:
- Has_value("old", "20 - 100 yrs")